American Society of Anesthesiologist Class 5

The above is a clinical trial exclusion criterion. Annotated with entity spans:
[Measurement: American Society of Anesthesiologist Class] [Value: 5]